¿Cuál de estas frases sobre la gluconeogénesis no es correcta?
1. En la gluconeogénesis se utilizan reacciones enzimáticas diferentes a la glucolisis.
2. La gluconeogénesis es la síntesis de la glucosa a partir de precursores que son hidratos de carbono.
3. La gluconeogénesis tiene como principales sustratos el lactato, aminoácidos, el propionato y el glicerol.
4. La gluconeogénesis tiene lugar principalmente en el citosol.
5. La gluconeogénesis utiliza enzimas específicas para evitar tres reacciones irreversibles en la glucolisis.

Respuesta correcta: 2. La gluconeogénesis es la síntesis de la glucosa a partir de precursores que son hidratos de carbono.